With severe systemic alteration;

The above is a clinical trial exclusion criterion. Annotated with entity spans:
With [Qualifier: severe] [Condition: systemic alteration];